Clinical trial exclusion criterion:
2. active infection at site of planned block

Annotated entities:
- Non-query-able: "2. active infection at site of planned block"